Clinical trial exclusion criteria:
patient's refusal
contraindications to dexmedetomidine
diseases/drugs that influence on autonomic nervous system activity

Annotated entities:
- Informed_consent: "patient's refusal"
- Condition: "contraindications"
- Drug: "dexmedetomidine"
- Condition: "diseases"
- Drug: "drugs"
- Qualifier: "influence on autonomic nervous system activity"